LVEF <45%

The above is a clinical trial inclusion criterion. Annotated with entity spans:
[Measurement: LVEF] [Value: <45%]